Primary kidney transplant recipients, adults

The above is a clinical trial inclusion criterion. Annotated with entity spans:
[Qualifier: Primary] [Procedure: kidney transplant] recipients, [Person: adults]